Clinical trial exclusion criterion:
Patients previously treated with HP eradication therapy

Annotated entities:
- Procedure: "HP eradication therapy"